Any patient whose condition will not allow for placement of the electrode PadSet.

The above is a clinical trial exclusion criterion. Annotated with entity spans:
Any patient whose [Condition: condition] will [Negation: not] [Mood: allow] for [Procedure: placement] of the [Device: electrode PadSet].